Clinical trial inclusion criterion:
Ankle-brachial pressure index above 0.7.

Entity relations:
- Has_value("Ankle-brachial pressure index", "above 0.7")